下列何者可用於治療放射性銫（radioactive cesium，137Cs）污染或鉈鹽（thallium salts）中毒？
A. EDTA
B. unithiol
C. deferasirox
D. prussian blue

正確答案：D. prussian blue